Clinical trial inclusion criterion:
Taking methotrexate without adequate control of symptoms

Annotated entities:
- Drug: "methotrexate"
- Negation: "without"
- Observation: "adequate control of symptoms"